Of childbearing potential with a positive serum pregnancy test, pregnant or lactating

The above is a clinical trial exclusion criterion. Annotated with entity spans:
Of [Person: childbearing potential] with a [Value: positive] [Measurement: serum pregnancy test], [Condition: pregnant] or [Condition: lactating]